Clinical trial exclusion criterion:
Currently taking 1 g or more of ascorbic acid supplementation daily

Annotated entities:
- Multiplier: "1 g or more"
- Drug: "ascorbic acid"